Clinical trial inclusion criteria:
Scheduled to undergo revision total knee arthroplasty

Annotated entities:
- Procedure: "revision total knee arthroplasty"